Clinical trial exclusion criterion:
Presence of conditions such as preeclampsia, multiparity, preterm labor

Entity relations:
- OR("preeclampsia", "preterm labor", "multiparity")